List the deadliest viruses in the world.

The filoviruses, Ebola virus (EBOV) and Marburg virus (MARV), are among the deadliest viruses that cause disease in humans, with reported case fatality rates of up to 90% in some outbreaks.
WHO ranks HIV as one of the deadliest diseases.
Influenza virus